Clinical trial inclusion criterion:
Age of at least 18 years

Annotated entities:
- Value: "at least 18 years"
- Person: "Age"